Clinical trial exclusion criterion:
Gastrointestinal bleeding in the previous 3 months.

Annotated entities:
- Condition: "Gastrointestinal bleeding"
- Temporal: "in the previous 3 months"